中年男性病人，有多年酗酒史，主訴腹瀉、體重減輕、吃過飽時上腹部疼痛難忍，腹痛時採坐姿且彎腰曲膝姿勢可稍減輕腹痛。臨床鑑別診斷首要考慮的疾病為：
A. 肝內結石
B. 慢性膽管炎
C. 慢性胰臟炎
D. 慢性十二指腸潰瘍

正確答案：C. 慢性胰臟炎